Meets 1 of the following: At least 12 months of spontaneous amenorrhea; At least 6 months of spontaneous amenorrhea with serum follicle-stimulating hormone (FSH) levels > 40 mIU/mL; At least 6 weeks postsurgical bilateral oophorectomy (with or without hysterectomy). Hysterectomized without bilateral oophorectomy and with serum FSH levels >40 mIU/mL.

The above is a clinical trial inclusion criterion. Annotated with entity spans:
[Multiplier: Meets 1 of the following]: [Line: At least 12 months of spontaneous amenorrhea]; [Temporal: At least 6 months] of [Condition: spontaneous amenorrhea] with [Measurement: serum follicle-stimulating hormone (FSH) levels] [Value: > 40 mIU/mL]; [Temporal: At least 6 weeks postsurgical] [Procedure: bilateral oophorectomy] (with or without hysterectomy). [Condition: Hysterectomized] [Negation: without] [Procedure: bilateral oophorectomy] and with [Measurement: serum FSH levels] [Value: >40 mIU/mL].